Una mujer de 60 años, diagnosticada de diabetes mellitus tipo 2 e hipertensión arterial, consulta por palpitaciones de semanas de evolución. Aporta un electrocardiograma realizado hace una semana en el que está en fibrilación auricular con frecuencia ventricular media de 70 lat/min. En la exploración física y en un nuevo electrocardiograma realizado en consulta está en ritmo sinusal. ¿Es necesario anticoagularla de forma crónica?
1. No es necesario anticoagular porque tiene una fibrilación auricular paroxística y ahora no está en fibrilación auricular.
2. No es necesario anticoagular porque es menor de 75 años y no ha tenido ictus previamente.
3. Debe anticoagularse de forma crónica porque tiene un CHADS de 2 y un CHADS-VASc de 3.
4. No es preciso anticoagular, pero sí pautarse antiagregación con ácido acetilsalicílico.
5. Debe anticoagularse solo con heparina de bajo peso molecular subcutánea cuando esté en fibrilación auricular.

Respuesta correcta: 3. Debe anticoagularse de forma crónica porque tiene un CHADS de 2 y un CHADS-VASc de 3.